Clinical trial exclusion criterion:
Contraindication to weight bearing on lower extremities

Entity relations:
- Has_context("Contraindication", "weight bearing on lower extremities")